Women must be postmenopausal (i.e.12 months without menstrual period), or surgically sterile, i.e. women of child bearing potential are not allowed to be included into the study. In cases of doubt a pregnancy test should be performed. (NB -post menopausal women currently receiving hormone replacement are permissible)

The above is a clinical trial inclusion criterion. Annotated with entity spans:
[Person: Women] must be [Condition: postmenopausal] (i.e.[Temporal: 12 months] [Negation: without] [Condition: menstrual period]), or [Condition: surgically sterile], i.e. [Person: women] of [Condition: child bearing potential] are [Negation: not] allowed to be included into the study. In cases of [Qualifier: doubt] a [Condition: pregnancy test] should be performed. (NB -post menopausal women currently receiving hormone replacement are permissible)